Clinical trial exclusion criterion:
Patients with a medical or psychiatric illness that would preclude study or informed consent and/or history of noncompliance to medical regimens or inability or unwillingness to return for all scheduled visits

Entity relations:
- Has_context("medical illness", "preclude study")
- OR("medical illness", "psychiatric illness")
- OR("preclude study", "unwillingness to return for all scheduled visit", "noncompliance to medical regimens", "informed consent", "inability to return for all scheduled visits")